下列何者常見於淋巴結的副皮質區（paracortex）？
A. 有高內皮細胞之小靜脈（high endothelial venule）
B. 淋巴小結（lymphatic nodule）
C. 漿細胞（plasma cell）
D. B 淋巴球（B-lymphocyte）

正確答案：A. 有高內皮細胞之小靜脈（high endothelial venule）